有關 Renovascular hypertension，下列敘述何者錯誤？
A. 導致 ischemic kidney 分泌 renin 過高
B. 只發生在年輕患者
C. 有些病人在腹部可聽到血管雜音（bruit）
D. 兩側 renal artery stenosis，應禁用 angiotensin converting enzyme inhibitors（ACEI）控制血壓

正確答案：B. 只發生在年輕患者